Clinical trial inclusion criterion:
Thoracoscopic surgery candidate.

Entity relations:
- Has_mood("Thoracoscopic surgery", "candidate")